末期腎病接受長期透析治療病人之主要死亡原因是下列何者？
A. 惡性腫瘤
B. 心血管疾病
C. 中樞神經系統疾病
D. 感染

正確答案：B. 心血管疾病